Desde un punto de vista clínico, ¿qué relevancia tiene administrar codeína a un paciente metabolizador rápido o extenso por citocromo CYP2D6?:
1. Se produce un incremento de la eficacia terapéutica de la codeína.
2. Se produce una disminución de la eficacia terapéutica de la codeína.
3. Se produce un incremento significativo de los efectos adversos por su rápida conversión a morfina.
4. Carece de relevancia clínica.

Respuesta correcta: 3. Se produce un incremento significativo de los efectos adversos por su rápida conversión a morfina.